Es conocido que el estaño es un metal plateadobrillante que, si se mantiene durante mucho tiempo por debajo de 13ºC, se transforma en un sólido de color gris mucho menos denso. Esto es debido a:
1. Su oxidación en SnO.
2. Su oxidación en SnO2.
3. Su corrosión en SnO2·nH2O.
4. La transición β α estaño.

Respuesta correcta: 4. La transición β α estaño.